HLA typing 相吻合的陌生人之間的器官移植仍會發生排斥反應，這是因為：
A. HLA typing 之判讀不良
B. 兩者之 histocompatibility minor antigens 不同
C. Clq 造成的細胞性免疫力（Clq-mediated cellular immunity）
D. 趨化激素引起的組織傷害（chemokine-mediated tissue damage）

正確答案：B. 兩者之 histocompatibility minor antigens 不同